Clinical trial exclusion criterion:
(9)Participation in a clinical trial for a drug that has not yet been officially approved for marketing within one month prior to the first visit.

Entity relations:
- AND("Participation in a clinical trial", "drug that has not yet been officially approved for marketing")
- Has_temporal("Participation in a clinical trial", "within one month prior to the first visit")
- Has_index("within one month prior to the first visit", "the first visit")